劉太太，現年45 歲。最近四年雙手發抖相當嚴重，右手幾乎無法用湯匙舀湯或用筷子夾菜，無法寫	，左手也無法拿碗，然而她仍然可以提水桶到花園澆花。經詢問病史，雙手發抖已將近20年，從右手開始，接	左手也發抖。她的父親也有類似長期雙手發抖現象，只是比較輕微。以及一位哥哥則有頭部顫抖的現象。除此之外，身體沒有其他異狀，也沒有慢性疾病。下列臨床診斷何者最有可能？
A. 全身性肌張力不全（generalized dystonia）
B. 脊髓小腦共濟失調症（spinocerebellar ataxia）
C. 巴金森病（Parkinson disease）
D. 原發性顫抖症（essential tremor）

正確答案：D. 原發性顫抖症（essential tremor）